A male or female between, and including, 18 and 50 years of age at the time of the first study visit.

The above is a clinical trial inclusion criterion. Annotated with entity spans:
A [Person: male] or [Person: female] between, and including, [Value: 18 and 50 years] of [Person: age] [Temporal: at the time of the first study visit].